下列何種病最常出現主動脈內層的樹皮樣外觀（tree-barking appearance）？
A. 粥狀動脈硬化
B. 高血壓性動脈硬化
C. 梅毒性主動脈炎
D. 主動脈狹窄

正確答案：C. 梅毒性主動脈炎